Clinical trial exclusion criterion:
Positive result of Cross Match.

Entity relations:
- Has_value("Cross Match", "Positive")